Allergy to local anesthetics

The above is a clinical trial exclusion criterion. Annotated with entity spans:
[Condition: Allergy] to [Procedure: local anesthetics]